Clinical trial exclusion criterion:
previous transfusion of blood products

Annotated entities:
- Temporal: "previous"
- Procedure: "transfusion of blood products"